¿Qué técnica cognitiva se utiliza en la terapia Racional Emotiva Conductual para ayudar a las personas que tienen dificultades intelectuales?
1. Reducción al absurdo.
2. Distracción cognitiva.
3. Entrenamiento en habilidades sociales.
4. Imaginación racional-emotiva.
5. Entrenamiento en autoinstrucciones.

Respuesta correcta: 5. Entrenamiento en autoinstrucciones.